下列何部位視網膜與玻璃體之間沾黏（vitreoretinal adhesion）得最緊密？
A. 視網膜血管周邊部位
B. 視網膜黃斑部（macula）周邊部位
C. 視神經（optic nerve）周邊部位
D. 玻璃體基底（vitreous base）周邊部位

正確答案：D. 玻璃體基底（vitreous base）周邊部位